一位 17 歲之男生因偏頭痛而服用非類固醇抗發炎藥物（NSAID）治療。半天前突然發生急性上腹痛，接著發生嘔吐，且咖啡底色之嘔吐物中見有血絲。經洗胃後，血絲很快自胃抽出物消失。則最可能的診斷是：
A. 克隆氏症（Crohn disease）
B. 十二指腸潰瘍
C. 胃發炎（gastritis）
D. 食道發炎（esophagitis）

正確答案：C. 胃發炎（gastritis）